What is the Pfam database?

The Pfam database provides a collection of curated protein families.